Clinical trial inclusion criterion:
patients with renal cancer coming to the laparoscopic radical nephrectomy

Annotated entities:
- Condition: "renal cancer"
- Qualifier: "laparoscopic"
- Procedure: "radical nephrectomy"